有關甲狀腺荷爾蒙對於人體代謝及發育的敘述，下列何者錯誤？
A. 在幼年期缺少甲狀腺荷爾蒙，會造成智力不足、身材矮小且終身不可逆的呆小症（cretinism）
B. 甲狀腺荷爾蒙可以降低細胞對氧氣的消耗，並且降低脂肪和碳水醣類化合物的代謝平衡，以提供正常生長和發育的需求
C. 若甲狀腺荷爾蒙過度分泌，會造成身體消瘦、情緒緊張焦慮、心跳加速、雙手顫抖，有時甚至會造成心臟衰竭
D. 甲狀腺荷爾蒙是維持生命所不可或缺的，一旦缺乏會造成人體對寒冷的耐受性降低，體重異常增加、身體黏液性腫（myxedema）、神智和身體活動變得笨拙和遲鈍

正確答案：B. 甲狀腺荷爾蒙可以降低細胞對氧氣的消耗，並且降低脂肪和碳水醣類化合物的代謝平衡，以提供正常生長和發育的需求